Lower back pain and/or sciatica with or without spinal claudication.

The above is a clinical trial inclusion criterion. Annotated with entity spans:
[Condition: Lower back pain] and/or [Condition: sciatica] with or without [Condition: spinal claudication].